Clinical trial exclusion criterion:
not fluent in English to be able to participate in the study process, including consent and phone interview

Annotated entities:
- Post-eligibility: "not fluent in English to be able to participate in the study process, including consent and phone interview"